Clinical trial exclusion criterion:
2. Cardiogenic shock / hemodynamic instability

Annotated entities:
- Parsing_Error: "2."
- Condition: "Cardiogenic shock"
- Condition: "hemodynamic instability"